Clinical trial exclusion criterion:
Allergy to tranexamic acid, floseal, rivaroxaban, or the excipients

Annotated entities:
- Condition: "Allergy"
- Drug: "tranexamic acid"
- Drug: "floseal"
- Drug: "rivaroxaban"
- Drug: "excipients"